Clinical trial exclusion criterion:
Life expectancy less than 6 months

Annotated entities:
- Observation: "Life expectancy"
- Value: "less than 6 months"